asthma and COPD

The above is a clinical trial exclusion criterion. Annotated with entity spans:
[Condition: asthma] and [Condition: COPD]